關於 Pneumocystis jirovecii（carinii）之敘述，下列何者正確？
A. 目前分類為原蟲
B. 屬於 Archiascomycetes
C. 於人工培養基生長緩慢
D. 經常感染肺結核病病人

正確答案：B. 屬於 Archiascomycetes